Cushing's disease is associated with a tumor in what part of the body?

Cushing's disease is associated with a tumor in the pituitary gland.